Clinical trial exclusion criterion:
Symptoms suggestive of obstructive or central sleep apnea (with a score of > 10 on Epworth sleepiness scale)

Entity relations:
- Has_value("Epworth sleepiness scale", "score of > 10")
- AND("obstructive sleep apnea", "Epworth sleepiness scale")
- OR("obstructive sleep apnea", "central sleep apnea")